下列有關威爾遜氏症（Wilson's disease，即hepatolenticular degeneration）的敘述，何者正確？
A. 病人的血中銅含量增加，但因為在肝臟及腦中沈澱，因此24小時尿中的銅量反而減少
B. 大約有一半的病人在5歲之前即會出現神經學的症狀
C. 在病人的角膜常出現具有診斷價值的凱斯-佛來斯環（Kayser-Fleischer ring）
D. 雖然攜帶銅離子的酵素ceruloplasmin高於正常值，但因其無法正常運作，因此出現症狀

正確答案：C. 在病人的角膜常出現具有診斷價值的凱斯-佛來斯環（Kayser-Fleischer ring）